有關婦女缺血性心臟病之敘述，下列何者錯誤？
A. 停經前婦女之發生率較男性低
B. 停經後則發生率逐漸上升，和男性趨近相同
C. 婦女較男性少接受心導管檢查，亦較少接受冠狀動脈再造（coronary revascularization）手術
D. 婦女對 statin 等藥物治療，所得預後改善（benefits of improved outcome）較男性差

正確答案：D. 婦女對 statin 等藥物治療，所得預後改善（benefits of improved outcome）較男性差